La causa de la fenilcetonuria es un déficit hereditario de:
1. Homogentisato dioxigenasa.
2. Tirosina aminotransferasa.
3. Fenilalanina hidroxilasa.
4. Dihidropteridina oxidasa.
5. Triptófano dioxigenasa.

Respuesta correcta: 3. Fenilalanina hidroxilasa.